Clinical trial inclusion criterion:
All renal (only) male and female recipients aged = 60, years undergoing kidney transplantation from a living or deceased donor, including Expanded Criteria Donors (ECD).

Annotated entities:
- Person: "male"
- Person: "female"
- Measurement: "aged"
- Value: "= 60"
- Condition: "recipients renal"
- Procedure: "kidney transplantation"
- Qualifier: "living donor"
- Qualifier: "deceased donor"
- Qualifier: "Expanded Criteria Donors (ECD)"